Clinical trial inclusion criterion:
Male and females between ages 18-85 years of age

Annotated entities:
- Person: "females"
- Person: "l"
- Value: "between 18-85 years of age"
- Person: "ages"